Substance abuse

The above is a clinical trial exclusion criterion. Annotated with entity spans:
[Condition: Substance abuse]